Clinical trial inclusion criterion:
(2) Body mass index (BMI):20-29.

Entity relations:
- Subsumes("Body mass index", "BMI")
- Has_value("Body mass index", "20-29")